Clinical trial inclusion criterion:
Patients undergoing laparoscopic or robotic colorectal resections

Annotated entities:
- Qualifier: "laparoscopic"
- Qualifier: "robotic"
- Procedure: "colorectal resections"